下列有關於藥物與受體交互作用之敘述，何者錯誤？
A. full agonist 對與活化狀態受體（active form）結合後的反應最高
B. partial agonist 對與不活化狀態受體（inactive form）的結合後仍有部分反應
C. inverse agonist 對與不活化狀態受體（inactive form）的結合後產生抑制性反應
D. antagonist 對於活化狀態受體（active form）和不活化狀態受體（inactive form）結合後皆無任何反應

正確答案：B. partial agonist 對與不活化狀態受體（inactive form）的結合後仍有部分反應